梅毒血清檢	包括nontreponemal tests（如VDRL或RPR test），及treponemal tests（如 FTA-ABS test，TP-PA test或TPHA）。下列敘述何者錯誤？
A. 大規模篩檢建議用VDRL或RPR test
B. 確定診斷建議用FTA-ABS test，TP-PA test或TPHA
C. 評估治療反應建議用FTA-ABS test，TP-PA test或TPHA
D. 診斷神經性梅毒，腦脊髓液建議用VDRL檢查

正確答案：C. 評估治療反應建議用FTA-ABS test，TP-PA test或TPHA